Clinical trial exclusion criterion:
Malignant tumor

Annotated entities:
- Condition: "Malignant tumor"